下列何種不會產生偽性大腦腫瘤症（pseudotumor cerebri）？
A. 過度肥胖併月經不規則
B. 大腦側靜脈竇阻塞（lateral venous sinus thrombosis）
C. 服用大量維生素 A
D. 惡性貧血

正確答案：D. 惡性貧血